Clinical trial inclusion criterion:
Weight: more than 40 Kg

Annotated entities:
- Measurement: "Weight"
- Value: "more than 40 Kg"